What personality traits can be evaluated with the Ten Item Personality Inventory.

The Ten Item Personality Inventory measures each of the five major facets of personality: openness, extroversion, conscientiousness, agreeableness and neuroticism.